Clinical trial exclusion criterion:
age <18y

Annotated entities:
- Person: "age"
- Value: "<18y"